Clinical trial inclusion criterion:
Must be willing to provide and have available archival tissue for PD-L1 testing.

Annotated entities:
- Non-query-able: "Must be willing to provide and have available archival tissue for PD-L1 testing."